C-peptide levels = 1.5 ng/mL

The above is a clinical trial inclusion criterion. Annotated with entity spans:
[Measurement: C-peptide levels] [Value: = 1.5 ng/mL]